El glucagón aumenta la actividad de la:
1. Proteína quinasa A.
2. Acetil-CoA carboxilasa.
3. Piruvato quinasa.
4. Glucógeno sintasa.
5. Fosfofructoquinasa-1.

Respuesta correcta: 1. Proteína quinasa A.